Known severe hepatic dysfunction

The above is a clinical trial exclusion criterion. Annotated with entity spans:
Known [Qualifier: severe] [Condition: hepatic dysfunction]